Clinical trial inclusion criterion:
Healthy male or female adolescents, age 12 to 17 years (inclusive) at Screening, with a body mass index (BMI) that is greater than or equal to the United States-weighted mean of the 95th percentile based on age and sex with a body weight greater than 60 kilograms (kg). Participants with Type 2 diabetes mellitus (T2DM) may have a pre-existing or new diagnosis of T2DM.

Entity relations:
- Has_value("age", "12 to 17 years")
- Has_temporal("age", "at Screening")
- multi("greater than or equal to the United States-weighted mean of the 95th percentile", "greater than or equal to the 95th percentile")
- Has_value("body mass index (BMI)", "greater than or equal to the United States-weighted mean of the 95th percentile")
- Has_qualifier("body mass index (BMI)", "based on age")
- Has_value("body weight", "greater than 60 kilograms (kg)")
- Has_qualifier("body mass index (BMI)", "based on sex")
- OR("male", "female")